Human immunodeficiency virus (HIV)-infected

The above is a clinical trial exclusion criterion. Annotated with entity spans:
[Condition: Human immunodeficiency virus (HIV)-infected]